Clinical trial inclusion criterion:
Negative pregnancy test (premenopausal female patient) at screening and use of adequate contraceptive measures (both male and female patients) throughout the study and 30 days after the last cis-UCA dose

Entity relations:
- Has_value("pregnancy test", "Negative")
- AND("premenopausal", "pregnancy test")
- AND("female", "pregnancy test")